Stable or unstable angina, including non ST-segment-elevation acute coronary syndrome (NSTE-ACS)

The above is a clinical trial inclusion criterion. Annotated with entity spans:
[Condition: Stable] or [Condition: unstable angina], including [Condition: non ST-segment-elevation acute coronary syndrome] ([Condition: NSTE-ACS])